Clinical trial exclusion criterion:
Chronic disease: renal, liver, cardiac, malignancy

Entity relations:
- Subsumes("Chronic disease", "renal malignancy")
- OR("renal malignancy", "liver malignancy", "cardiac malignancy")